5. Bosentan

The above is a clinical trial exclusion criterion. Annotated with entity spans:
[Parsing_Error: 5.] [Drug: Bosentan]